Clinical trial exclusion criterion:
contraindications to sildenafil use or CMR imaging;

Annotated entities:
- Condition: "contraindications"
- Drug: "sildenafil"
- Procedure: "CMR imaging"